一位 10 歲男童在發燒一天之後，臉頰潮紅並在四肢出現網狀紅斑，則最可能的診斷是：
A. 傳染性紅斑（erythema infectiosum）
B. 德國麻疹（rubella）
C. 猩紅熱（scarlet fever）
D. 腸病毒感染（enterovirus infection）

正確答案：A. 傳染性紅斑（erythema infectiosum）